Clinical trial inclusion criterion:
3. Patients with chronic heart failure (NYHA class II or III);

Annotated entities:
- Condition: "chronic heart failure"
- Measurement: "NYHA"
- Value: "class II or III"